What causes leishmaniasis?

Leishmania spp. is a group of very successful protozoan parasites that cause a range of diseases from self-healing cutaneous leishmaniasis to visceral leishmaniasis.